Neurological or medical conditions that would interfere with MRI scanning (e.g. history of stroke, seizure, brain tumor, brain infection, traumatic brain injury, multiple sclerosis, dementia, metal device in body, pregnancy, claustrophobia, color blindness, severe hearing impairment, weight>300 lbs., wheelchair-bound)

The above is a clinical trial exclusion criterion. Annotated with entity spans:
Neurological or [Condition: medical conditions] that would [Condition: interfere] with [Procedure: MRI scanning] (e.g. history of [Condition: stroke], [Condition: seizure], [Condition: brain tumor], [Condition: brain infection], [Condition: traumatic brain injury], [Condition: multiple sclerosis], [Condition: dementia], [Device: metal device in body], [Condition: pregnancy], [Condition: claustrophobia], [Condition: color blindness], [Qualifier: severe] [Condition: hearing impairment], [Measurement: weight][Value: >300 lbs.], [Condition: wheelchair-bound])